Clinical trial exclusion criterion:
History or current clinical evidence of moderate-to-severe fixed obstructive pulmonary disease or severe reactive airway diseases (e.g., asthma) requiring hospitalization within the past 2 years or patient currently using long-term inhaled bronchodilators

Entity relations:
- Has_qualifier("obstructive pulmonary disease", "fixed")
- Has_qualifier("obstructive pulmonary disease", "moderate-to-severe")
- Subsumes("reactive airway diseases", "asthma")
- Has_qualifier("reactive airway diseases", "severe")
- Has_mood("obstructive pulmonary disease", "clinical evidence of")
- Has_temporal("obstructive pulmonary disease", "History")
- Has_mood("hospitalization", "requiring")
- Has_temporal("long-term inhaled bronchodilators", "currently")
- Has_temporal("hospitalization", "within the past 2 years")
- Has_index("within the past 2 years", "the past 2 years")
- AND("obstructive pulmonary disease", "hospitalization")
- OR("History", "current")
- OR("obstructive pulmonary disease", "reactive airway diseases")
- OR("hospitalization", "long-term inhaled bronchodilators")